Which loss-of-function ABCC8 mutation is associated with Pulmonary Arterial Hypertension (PAH)?

A de novo novel heterozygous predicted deleterious missense variant c.G2873A (p.R958H) in ABCC8 in a child with idiopathic PAH.